Diagnosis as CD first time or first year.

The above is a clinical trial exclusion criterion. Annotated with entity spans:
Diagnosis as [Condition: CD] [Qualifier: first time] or [Qualifier: first year].